Subjects must:

The above is a clinical trial inclusion criterion. Annotated with entity spans:
[Parsing_Error: Subjects must:]